下列何者較少出現在 Neurofibromatosis type I 的病人？
A. 家族顯性遺傳
B. 雙側聽神經瘤
C. 皮膚咖啡牛奶斑（Café-au-lait macules）
D. 脊椎發育異常

正確答案：B. 雙側聽神經瘤